Clinical trial inclusion criterion:
signed informed consent

Annotated entities:
- Post-eligibility: "signed informed consent"